Clinical trial exclusion criterion:
Is a transplant recipient (except for corneal transplant).

Entity relations:
- Has_negation("corneal transplant", "except")